Patients with a known diagnosis of defective hemostasis and past history of clinical bleeding requiring transfusion and treatment;

The above is a clinical trial exclusion criterion. Annotated with entity spans:
Patients with a known diagnosis of [Qualifier: defective] [Condition: hemostasis] and past history of clinical [Condition: bleeding] requiring [Procedure: transfusion] and [Procedure: treatment];